3. Written informed consent

The above is a clinical trial inclusion criterion. Annotated with entity spans:
[Parsing_Error: 3.] Written informed consent